Clinical trial inclusion criterion:
CC resistance (defined as failure of ovulation after receiving 150 mg/day of CC for 5 consecutive days per cycle, for at least 3 consecutive cycles).

Annotated entities:
- Condition: "resistance"
- Drug: "CC"
- Non-query-able: "defined as failure of ovulation after receiving 150 mg/day of CC for 5 consecutive days per cycle, for at least 3 consecutive cycles"